Which VKORC1 genotypes are associated with a need for lower warfarin maintenance dose?

Patients with VKORC1-1639GA or AA required a lower warfarin maintenance dose.